Clinical trial exclusion criterion:
Evidence in the clinic history of relevant bilateral stenosis of renal artery (> 75%)

Annotated entities:
- Qualifier: "relevant"
- Qualifier: "bilateral"
- Condition: "stenosis of renal artery"
- Value: "> 75%"